Clinical trial exclusion criterion:
Contraindication for propofol administration

Annotated entities:
- Condition: "Contraindication"
- Drug: "propofol"